Clinical trial exclusion criterion:
Subjects with elevated uric acid levels greater than 10 mg/dL or gout

Entity relations:
- Subsumes("elevated", "greater than 10 mg/dL")
- Has_value("uric acid levels", "elevated")
- OR("uric acid levels", "gout")